The participant has a diagnosis of Parkinson's disease according to the diagnostic criteria of the UK Parkinson's Disease Society Brain Bank.

The above is a clinical trial inclusion criterion. Annotated with entity spans:
The participant has a diagnosis of [Condition: Parkinson's disease] according to the diagnostic criteria of the [Measurement: UK Parkinson's Disease Society Brain Bank].